Unable to take oral medications.

The above is a clinical trial exclusion criterion. Annotated with entity spans:
[Observation: Unable to take oral medications].